下列有關腦性麻痺的敘述，何者錯誤？
A. 近年來因為醫學的進步，腦性麻痺的發生率已降至非常低，成為不常見的疾病
B. 因早產兒存活率增加，使得腦性麻痺中早產兒所占比率相對提高
C. 在腦性麻痺的分類中，徐動型的比率近年來有明顯下降
D. 早產兒最常合併的腦性麻痺類型為兩側癱瘓（diplegia）

正確答案：A. 近年來因為醫學的進步，腦性麻痺的發生率已降至非常低，成為不常見的疾病